Clinical trial inclusion criterion:
1. Age 18 years or older

Annotated entities:
- Parsing_Error: "1."
- Value: "18 years or older"
- Person: "Age"